Clinical trial inclusion criterion:
Have one of the following disease histories:

Annotated entities:
- Parsing_Error: "Have one of the following disease histories:"